Clinical trial exclusion criterion:
Drug allergy

Entity relations:
- AND("allergy", "Drug")